Which human chromosome is the product of fusion?

The evolution of African great ape subtelomeric heterochromatin and the fusion of human chromosome 2. We propose a model where an ancestral human-chimpanzee pericentric inversion and the ancestral chromosome 2 fusion both predisposed and protected the chimpanzee and human genomes, respectively, to the formation of subtelomeric heterochromatin.